Clinical trial inclusion criterion:
Diagnosis of posterior circulation ischemic stroke;

Annotated entities:
- Condition: "posterior circulation ischemic stroke"